Adequate hepatic, bone marrow, and renal function

The above is a clinical trial inclusion criterion. Annotated with entity spans:
[Value: Adequate] hepatic, [Measurement: bone marrow], and [Measurement: renal function]